一位 60 歲男性病人被告知其肝臟右葉有一個 3 公分大的肝癌，其肝功能為正常及 Child-Pugh class A，無門脈侵犯及遠端器官轉移現象，也無其他嚴重疾病，則最可能建議病人接受那一項治療？
A. 經皮局部酒精注射（percutaneous ethanol injection）
B. 化學療法（systemic chemotherapy）
C. 肝動脈栓塞治療（transcatheter arterial embolization）
D. 部分肝切除術（partial hepatectomy）

正確答案：D. 部分肝切除術（partial hepatectomy）